Chronic cardiovascular/pulmonary disease

The above is a clinical trial exclusion criterion. Annotated with entity spans:
[Temporal: Chronic] [Condition: cardiovascular]/[Condition: pulmonary disease]